Clinical trial exclusion criterion:
Active opportunistic infections

Annotated entities:
- Condition: "opportunistic infections"
- Qualifier: "Active"